Clinical trial exclusion criterion:
Taking therapeutic doses of anti-coagulants or anti-platelet therapy (prophylactic doses started because of hospital admission are not an exclusion)

Annotated entities:
- Drug: "anti-coagulants"
- Drug: "anti-platelet therapy"
- Qualifier: "therapeutic"
- Qualifier: "prophylactic"
- Negation: "not"